Which drugs were tested in the CheckMate 227 clinical trial?

CheckMate-227 clinical trial tested ipilimumab plus nivolumab for the treatment of non-small cell lung cancer.